Clinical trial inclusion criterion:
10. Serum creatinine ≤1.5 × ULN and glomerular filtration rate (GFR) > 30 mL/min

Entity relations:
- Has_value("glomerular filtration rate (GFR)", "> 30 mL/min")
- Has_value("Serum creatinine", "≤1.5 × ULN")